感染性心內膜炎最重要的死因是：
A. 腦膿瘍（brain abscess）
B. 敗血症（sepsis）
C. 腎衰竭
D. 心衰竭

正確答案：D. 心衰竭